Clinical trial exclusion criterion:
Chronic use of analgesic drugs (more than 3 months)

Annotated entities:
- Temporal: "Chronic"
- Drug: "analgesic drugs"
- Temporal: "more than 3 months"